What is the link between psoriatic arthritis and depression

Psoriasis is a common chronic inflammatory disease which is associated with extensive comorbidities, including psoriatic arthritis.